Diagnosed with head and neck cancer and treated for a period of up to 5 years with radiotherapy where the major salivary glands (parotid, submandibular and sublingual) were included in the radiation field;

The above is a clinical trial inclusion criterion. Annotated with entity spans:
Diagnosed with [Condition: head and neck cancer] and treated for a period of up to [Temporal: 5 years] with [Procedure: radiotherapy] where the [Qualifier: major salivary glands] ([Qualifier: parotid], [Qualifier: submandibular] and [Qualifier: sublingual]) were included in the radiation field;